Clinical trial exclusion criterion:
Patients using oral contraception.

Entity relations:
- multi("oral contraception", "oral contraception")